Spontaneous labor (latent or active phase)

The above is a clinical trial exclusion criterion. Annotated with entity spans:
[Condition: Spontaneous labor] ([Qualifier: latent] or [Qualifier: active phase])